What is miravirsen?

Miravirsen is the first miRNA-targeting drug for the treatment of hepatitis C.